一位 22 歲的男性最近感到不適，並發覺自己體重驟減 30 磅，最近更發生輕微的發燒等流感症狀，並患有鵝口瘡（thrush），伴隨嚴重而頻繁的腹瀉，此外亦有呼吸困難的現象，經肺部 X 光檢查顯示兩側有浸潤現象，在糞便檢體中測出梨形鞭毛蟲（Giardia），此患者最可能被何病原菌感染而造成上述之病徵？
A. 疱疹病毒（herpesvirus）
B. 細小病毒 B19（parvovirus B19）
C. 人類免疫缺乏病毒（HIV）
D. 流行性感冒病毒（influenza virus）

正確答案：C. 人類免疫缺乏病毒（HIV）